下列何者可刺激 GnRH pulses？
A. Hyperprolactinemia
B. Cushing's disease
C. Catecholamine
D. Acromegaly

正確答案：C. Catecholamine